一個新生兒出生後第5分鐘時呈現心跳每分鐘75次、呼吸緩慢不規則、全身發紺（Cyanosis）、上肢體有些微彎曲但下肢體軟趴、對抽痰刺激僅有皺眉反應。根據你的評估Apgar score是幾分？
A. 2
B. 4
C. 6
D. 8

正確答案：B. 4